Clinical trial inclusion criterion:
patients scheduled for elective breast mastectomy or quadrantectomy

Entity relations:
- Has_qualifier("breast quadrantectomy", "elective")
- OR("breast quadrantectomy", "mastectomy")